2. Left ventricular ejection fraction (LVEF) ≤ 40% (ECHO);

The above is a clinical trial inclusion criterion. Annotated with entity spans:
2. [Measurement: Left ventricular ejection fraction (LVEF)] [Value: ≤ 40%] ([Procedure: ECHO]);